病例對照研究中，吸菸對口腔癌發生之勝算比值（odds ratio）為 2.0 倍。若健康對照個案之中有 25% 個案吸菸，則 400 名罹患口腔癌病患之中有多少名病患吸菸？
A. 100
B. 160
C. 200
D. 240

正確答案：B. 160